Pregnant females

The above is a clinical trial exclusion criterion. Annotated with entity spans:
[Condition: Pregnant] [Person: females]